Clinical trial exclusion criteria:
With acute diseases, such as acute phase after myocardial infarction (within 3 months), within 3 months after acute heart failure or new cerebral infarction;
In the list of heart transplantation;
Expected survival less than 1 year;
With other hemorrhagic diseases and anticoagulant therapy is not allowed;
Thrombosis in left atrium;
Heart failure, New York Heart Association(NYHA) III/IV or eject fraction(EF)<40%;
Patients with uncontrolled cancer;
Significant hepatic or renal impairment (and/or alanine transaminase(ALT) or Aspartate transaminase(AST) >2 times upper limit of normal, creatinine clearance rate(CCr)<50%);
Previous catheter radiofrequency ablation for AF or cardiac surgery;
Pregnant and lactating women, women who plan to become pregnant, or women of child bearing age not using reliable contraceptive measures.

Annotated entities:
- Condition: "acute diseases"
- Temporal: "acute phase"
- Condition: "myocardial infarction"
- Temporal: "within 3 months"
- Temporal: "within 3 months"
- Condition: "acute heart failure"
- Condition: "cerebral infarction"
- Procedure: "heart transplantation"
- Mood: "In the list"
- Observation: "Expected survival"
- Value: "less than 1 year"
- Condition: "hemorrhagic diseases"
- Qualifier: "other"
- Procedure: "anticoagulant therapy"
- Condition: "not allowed"
- Condition: "Thrombosis"
- Qualifier: "left atrium"
- Condition: "Heart failure"
- Measurement: "New York Heart Association(NYHA)"
- Value: "III/IV"
- Measurement: "eject fraction(EF)"
- Value: "<40%"
- Qualifier: "uncontrolled"
- Condition: "cancer"
- Condition: "renal impairment"
- Condition: "hepatic impairment"
- Qualifier: "Significant"
- Measurement: "alanine transaminase(ALT)"
- Measurement: "Aspartate transaminase(AST)"
- Value: ">2 times upper limit of normal"
- Measurement: "creatinine clearance rate(CCr)"
- Value: "<50%"
- Procedure: "catheter radiofrequency ablation"
- Condition: "AF"
- Procedure: "cardiac surgery"
- Pregnancy_considerations: "Pregnant and lactating women, women who plan to become pregnant, or women of child bearing age not using reliable contraceptive measures."